current ongoing psychiatric disorder

The above is a clinical trial exclusion criterion. Annotated with entity spans:
[Temporal: current] [Temporal: ongoing] [Condition: psychiatric disorder]